Transplant from donor positive for HIV, HBsAg, Hepatitis C.

The above is a clinical trial exclusion criterion. Annotated with entity spans:
[Procedure: Transplant] from [Qualifier: donor] [Condition: positive for HIV], HBsAg, Hepatitis C.